Significant renal dysfunction (Serum creatinine > 2.0 mg/dl

The above is a clinical trial exclusion criterion. Annotated with entity spans:
[Qualifier: Significant] [Condition: renal dysfunction] ([Measurement: Serum creatinine] [Value: > 2.0 mg/dl]